¿Cuál de los siguientes NO es una evaluación económica completa?
1. Análisis de minimización de costes.
2. Análisis de costes directos e indirectos.
3. Análisis de Coste-efectividad.
4. Análisis de Coste-utilidad.
5. Análisis de Coste-beneficio.

Respuesta correcta: 2. Análisis de costes directos e indirectos.